List symptoms of the Zieve's syndrome.

Zieve's syndrome, characterized by jaundice, hyperlipidaemia and haemolytic anaemia. It usually develops in young, chronically alcoholic subjects with enlarged fatty liver. It may rarely occur with intracranial haemorrhage.